Clinical trial inclusion criterion:
Documented genotype 1 HCV infection prior to enrollment and after their transplant in the post-transplantation cohort

Entity relations:
- Has_index("prior to enrollment", "enrollment")
- Has_index("after their transplant i", "transplant")
- Has_qualifier("HCV infection", "genotype 1")
- Has_temporal("HCV infection", "prior to enrollment")
- Has_temporal("HCV infection", "after their transplant i")